Personal history of breast cancer

The above is a clinical trial exclusion criterion. Annotated with entity spans:
[Temporal: Personal history] of [Condition: breast cancer]